Respecto a los ejercicios con el espirómetro de incentivo es cierto que:
1. Estimulan al paciente para que inhale de manera rápida y profunda.
2. El paciente debe estar en decúbito supino.
3. Los espirómetros pueden ser de tres tipos: de volumen, de flujo o de presión.
4. También se les denomina ejercicios de inspiración máxima sostenida.
5. Todas son falsas.

Respuesta correcta: 4. También se les denomina ejercicios de inspiración máxima sostenida.